下列有關 clomiphene 的藥理學作用描述，何者錯誤？
A. 為一種雌激素受體部分作用劑（partial estrogen agonist），可以刺激促性腺激素（gonadotropins）的分泌作用
B. 對於排卵功能障礙的婦女具有刺激排卵的作用
C. 使用時會降低血漿中黃體化激素（LH）和濾泡促進素（FSH）的濃度
D. 容易誘發熱潮紅（hot flushes）的產生

正確答案：C. 使用時會降低血漿中黃體化激素（LH）和濾泡促進素（FSH）的濃度